Clinical trial exclusion criterion:
Kidney disease not caused by diabetes or hypertension

Entity relations:
- OR("Kidney disease", "hypertension", "diabetes")